Clinical trial inclusion criterion:
Any intramuscular or intravenous corticosteroid injection within 2 weeks before baseline

Entity relations:
- Has_qualifier("corticosteroid injection", "intramuscular")
- Has_index("within 2 weeks before baseline", "baseline")
- Has_temporal("corticosteroid injection", "within 2 weeks before baseline")
- OR("intramuscular", "intravenous")